History of bleeding diathesis or known coagulopathy (including heparin-induced thrombocytopenia), or refuses blood transfusions.

The above is a clinical trial exclusion criterion. Annotated with entity spans:
[Temporal: History] of [Condition: bleeding diathesis] or known [Condition: coagulopathy] (including [Condition: heparin-induced thrombocytopenia]), or [Observation: refuses blood transfusions].